肉毒桿菌毒素（botulinus toxin）降低肌肉張力之機制為何？
A. 直接作用在腦部（brain）
B. 直接作用在運動神經元上（motor neuron）
C. 直接作用在神經肌肉交界處（neuromuscular junction）
D. 直接作用在肌肉上鈣離子通道（calcium channel of muscle）

正確答案：C. 直接作用在神經肌肉交界處（neuromuscular junction）